Clinical trial exclusion criterion:
BMI>40

Annotated entities:
- Measurement: "BMI"
- Value: ">40"